一位 24 歲男性因車禍突然出現右側下肢無力及左側下肢感覺異常，經送醫檢查發現右下肢肌力下降、左下肢對冷熱疼痛感覺下降並延伸至同側肚臍處，合併雙下肢深部肌腱反射異常增強及出現 Babinski 反射，患者最可能之神經解剖病灶為何？
A. 右側延腦
B. 左側大腦
C. 右側胸椎脊髓
D. 左側胸椎脊髓

正確答案：C. 右側胸椎脊髓